Se forman por maduración de los endosomas tardíos:
1. Lisosomas.
2. Fagosomas.
3. Cuerpos multivesiculares.
4. Gránulos de secreción.
5. Proteosomas.

Respuesta correcta: 1. Lisosomas.